Clinical trial exclusion criterion:
Cancer with current treatment

Annotated entities:
- Condition: "Cancer"
- Procedure: "treatment"
- Temporal: "current"